Clinical trial inclusion criterion:
Estimated gestational age greater than 20 weeks

Entity relations:
- Has_value("Estimated gestational age", "greater than 20 weeks")